在下列何種情況下，acetyl-CoA 進入 citric acid cycle 會減少？
A. [AMP]/[ATP]高
B. [ATP]/[ADP]高
C. [NAD+]/[NADH]高
D. [oxaloacetate]高

正確答案：B. [ATP]/[ADP]高